Clinical trial exclusion criterion:
3. Hepatic insufficiency defined as total bilirubin > 2 mg/dL or serum albumin < 25 g/L

Annotated entities:
- Parsing_Error: "3."
- Condition: "Hepatic insufficiency"
- Measurement: "total bilirubin"
- Value: "> 2 mg/dL"
- Measurement: "serum albumin"
- Value: "< 25 g/L"